Clinical trial inclusion criterion:
surgery less than 3 hours.

Annotated entities:
- Measurement: "surgery"
- Temporal: "less than 3 hours"